Clinical trial exclusion criterion:
Need for long-term treatment with a low molecular weight heparin, vitamin K antagonists or NOAC, for an indication other than the index PE episode, or for antiplatelet agents except acetylsalicylic acid at a dosage =100 mg/day;

Entity relations:
- Has_qualifier("PE episode", "index")
- Has_negation("PE episode", "other")
- AND("vitamin K antagonists", "PE episode")
- Has_negation("acetylsalicylic acid", "except")
- Has_multiplier("antiplatelet agents", "=100 mg/day;")
- Has_qualifier("low molecular weight heparin", "long-term")
- AND("vitamin K antagonists", "NOAC")
- OR("low molecular weight heparin", "vitamin K antagonists", "NOAC")
- OR("vitamin K antagonists", "antiplatelet agents")